下列病菌致病之病理機轉主要是經由細菌產生之外毒素，何者除外？
A. 霍亂弧菌
B. 白喉桿菌
C. 肉毒桿菌
D. 肺結核分枝桿菌

正確答案：D. 肺結核分枝桿菌